下列有關壞死性血管炎（necrotizing vasculitis）之敘述何者錯誤？
A. 可觸及之紫斑（palpable purpura）是典型的病灶
B. 是一種免疫複合體疾病（immune complex disease）
C. 炎症發生於大血管
D. 過敏性紫斑（Henoch-Schönlein purpura）乃是與 IgA 相關之壞死性血管炎

正確答案：C. 炎症發生於大血管